Clinical trial inclusion criteria:
Early, intermediate, advanced, non metastatic Hepatocellular Carcinoma. Indication for radioembolization validated after pluridisciplinary committee meeting.
Isolated target on initial imagery (invasive hepatocellular carcinoma excluded)
WHO (World Health organization) Performance status: 0, 1 or 2
If cirrhosis, Child A score with total bilirubin less than 30 micromoles per liter
Creatinine clearance more or equal to 30 mL/min
Patient informed and consent signature obtained

Annotated entities:
- Condition: "Hepatocellular Carcinoma"
- Negation: "non"
- Qualifier: "metastatic"
- Qualifier: "advanced"
- Qualifier: "intermediate"
- Qualifier: "Early"
- Procedure: "radioembolization"
- Observation: "Indication"
- Subjective_judgement: "Indication"
- Non-query-able: "validated after pluridisciplinary committee meeting"
- Context_Error: "Isolated target on initial imagery (invasive hepatocellular carcinoma excluded)"
- Measurement: "WHO (World Health organization) Performance status"
- Value: "0, 1 or 2"
- Condition: "cirrhosis"
- Measurement: "Child score"
- Value: "A"
- Measurement: "total bilirubin"
- Value: "less than 30 micromoles per liter"
- Measurement: "Creatinine clearance"
- Value: "more or equal to 30 mL/min"
- Post-eligibility: "Patient informed and consent signature obtained"